Psychiatric disorder

The above is a clinical trial exclusion criterion. Annotated with entity spans:
[Condition: Psychiatric disorder]